Which protein interacts with the Ragulator-RAG GTPases to control mTOR activity?

Extensive functional proteomic analysis established SLC38A9 as an integral part of the Ragulator-RAG GTPases machinery that controls the activation of mTOR.